Las aminotransferasas:
1. Participan solo en la síntesis de aminoácidos.
2. Participan solo en la degradación de aminoácidos.
3. Participan en la síntesis y degradación de aminoácidos.
4. Sus niveles en corazón son muy bajos.
5. Ninguna de las anteriores respuestas es verdadera.

Respuesta correcta: 3. Participan en la síntesis y degradación de aminoácidos.